Clinical trial inclusion criterion:
Easten Cooperative Oncology Group score = 2

Annotated entities:
- Measurement: "Easten Cooperative Oncology Group score"
- Value: "= 2"